根據原行政院衛生署 100 年公告之「人體研究法」，下列那一項不包括在人體研究的範圍？
A. 調查個人行為
B. 分析病患基因資訊
C. 分析肺炎致病菌之菌種
D. 取得人體組織

正確答案：C. 分析肺炎致病菌之菌種